若病人之渥尼氏區域（Wernicke's area）受損，常出現何種語言障礙？
A. 聽理解受損
B. 語言之流暢度受損
C. 會出現電報式的語言（telegraphic speech）
D. 會一直重複他人語言（echolalia）

正確答案：A. 聽理解受損